Clinical trial inclusion criterion:
adult patients

Annotated entities:
- Person: "adult"